Clinical trial inclusion criterion:
Tobacco use: Subjects with a current or prior history of >=10 pack-years of cigarette smoking at screening (Visit 1). Previous smokers are defined as those who have stopped smoking for at least 6 months prior to Visit 1.

Entity relations:
- Has_multiplier("cigarette smoking", ">=10 pack-years")
- Has_temporal("cigarette smoking", "at screening")
- Has_temporal("cigarette smoking", "history")
- Has_temporal("cigarette smoking", "current")
- Has_index("for at least 6 months prior to Visit 1", "Visit 1")
- Has_temporal("stopped smoking", "for at least 6 months prior to Visit 1")
- Subsumes("Previous smokers", "stopped smoking")
- OR("current", "prior")